Clinical trial exclusion criterion:
Chronic liver disease or cirrhosis

Annotated entities:
- Condition: "Chronic liver disease"
- Condition: "cirrhosis"